Cuando un sujeto realiza juicio sobre la frecuencia de un acontecimiento en función de los ejemplos que recuerda de manera más inmediata, está desarrollando un proceso cognitivo denominado:
1. Sesgo de Representatividad.
2. Sesgo de Disponibilidad.
3. Correlación ilusoria.
4. Error fundamental de atribución.

Respuesta correcta: 2. Sesgo de Disponibilidad.